Current renal (creatinine>2x upper limit of normal (ULN), dialysis, kidney transplant) or hepatic dysfunction (AST/ALT>2x ULN, liver transplant or neoplasm)

The above is a clinical trial exclusion criterion. Annotated with entity spans:
Current [Condition: renal] ([Measurement: creatinine][Value: >2x upper limit of normal (ULN)], [Procedure: dialysis], [Procedure: kidney transplant]) or [Condition: hepatic dysfunction] ([Measurement: AST]/[Measurement: ALT][Value: >2x ULN], [Procedure: liver transplant] or [Condition: neoplasm])